Clinical trial inclusion criterion:
Patients who require medication for more than 12 weeks due to osteoarthritis symptoms.

Annotated entities:
- Drug: "medication"
- Multiplier: "more than 12 weeks"
- Condition: "osteoarthritis symptoms"